Patients who responded inadequately (a score of >18 on the MADRS) to first-line antidepressant treatment of 4 week duration

The above is a clinical trial inclusion criterion. Annotated with entity spans:
Patients who [Observation: responded inadequately] (a [Value: score of >18] on the [Measurement: MADRS]) to [Qualifier: first-line] [Drug: antidepressant] treatment [Temporal: of 4 week] duration